Clinical trial exclusion criterion:
9. Use of tobacco products and/or history of smoking within the past 2 months

Entity relations:
- Has_temporal("smoking", "history")
- Has_temporal("smoking", "within the past 2 months")
- OR("tobacco products", "smoking")